Clinical trial inclusion criterion:
Respiratory muscle weakness (Pi,max < 70cmH2O)

Annotated entities:
- Condition: "Respiratory muscle weakness"
- Measurement: "Pi,max"
- Value: "< 70cmH2O"